Clinical trial inclusion criterion:
Able to Extubate

Annotated entities:
- Mood: "Able to"
- Procedure: "Extubate"